Clinical trial exclusion criterion:
history of allergy to study drugs

Annotated entities:
- Condition: "allergy"
- Drug: "study drugs"